一位 38 歲女性，因左側乳癌接受左側乳房保留手術，及腋下淋巴結廓清手術，手術後病理檢查發現為乳管癌，有 12 顆淋巴結確定有乳癌轉移，estrogen receptor 陰性，progesterone receptor 陰性，Her-2 染色呈 3 價陽性反應，下列何種術後輔助性治療最不恰當？
A. 放射治療
B. 化學治療
C. 荷爾蒙拮抗治療
D. 抗 Her-2 抗體治療

正確答案：C. 荷爾蒙拮抗治療